Clinical trial exclusion criterion:
Secondary causes of osteoarthritis;

Annotated entities:
- Condition: "osteoarthritis"
- Condition: "Secondary causes"
- Undefined_semantics: "Secondary causes of osteoarthritis"